下列何者是眼瞼退縮肌（eyelid retractor）之功能？
A. 眼睛閉合
B. 眼睛張開
C. 防止沙塵掉落眼睛
D. 讓淚水分布到眼角膜

正確答案：B. 眼睛張開